Previously treated with ADASUVE® with a positive outcome (responders) according to (CGI-I) scale (defined as having a CGI-I score of 1 or 2 at 2 hours after administration of the inhalation)

The above is a clinical trial inclusion criterion. Annotated with entity spans:
Previously treated with [Drug: ADASUVE]® with a positive outcome (responders) according to (CGI-I) scale (defined as having a [Measurement: CGI-I score] of [Value: 1 or 2] at [Temporal: 2 hours after administration of the inhalation)]